Which syndrome is caused by dysfunction of the ciliary ARMC9/TOGARAM1 protein?

Dysfunction of the ciliary ARMC9/TOGARAM1 protein module causes Joubert syndrome.